Clinical trial exclusion criterion:
Severe comorbidity.

Annotated entities:
- Condition: "comorbidity"
- Qualifier: "Severe"